Clinical trial inclusion criterion:
7) HRSD question #9 regarding suicide <2,

Annotated entities:
- Measurement: "HRSD question #9"
- Value: "<2"
- Parsing_Error: "7)"